Clinical trial exclusion criterion:
Hepatosplenomegaly

Annotated entities:
- Condition: "Hepatosplenomegaly"